腦內動脈二氧化碳（CO2）濃度上升時，腦內血管及血流變化為何？
A. 微動脈（arterioles）擴張，血流量不變
B. 微動脈（arterioles）擴張，血流量上升
C. 微動脈（arterioles）收縮，血流量下降
D. 微動脈（arterioles）收縮，血流量不變

正確答案：B. 微動脈（arterioles）擴張，血流量上升